Clinical trial exclusion criteria:
Revision total knee arthroplasty
Bilateral total knee arthroplasty
Patients with inflammatory arthritis
Patients with a body mass index (BMI) > 40
Allergy to ropivacaine, bupivacaine, or other local anesthetic agents
Current use of opioid drugs
Patients with a history of total or unicompartmental reconstruction of the affected joint
Patients that have had a high tibial osteotomy or femoral osteotomy
Patients with neuromuscular or neurosensory deficiency, which would limit the ability to assess pain levels
Patients with a systemic or metabolic disorder leading to progressive bone deterioration
Patients that are immunologically compromised, or receiving chronic steroids (>30 days), excluding inhalers
Patients' bone stock is compromised by disease or infection, which cannot provide adequate support and/or fixation to the prosthesis
Patients with knee fusion to the affected joint
Patients with an active or suspected latent infection in or about the knee joint
Patients that are prisoners

Annotated entities:
- Procedure: "Revision total knee arthroplasty"
- Procedure: "Bilateral total knee arthroplasty"
- Condition: "inflammatory arthritis"
- Measurement: "body mass index"
- Measurement: "BMI"
- Value: "> 40"
- Condition: "Allergy"
- Drug: "ropivacaine"
- Drug: "bupivacaine"
- Drug: "local anesthetic agents"
- Drug: "opioid"
- Qualifier: "affected joint"
- Procedure: "reconstruction"
- Qualifier: "unicompartmental"
- Qualifier: "total"
- Procedure: "high tibial osteotomy"
- Procedure: "femoral osteotomy"
- Condition: "neuromuscular deficiency"
- Condition: "neurosensory deficiency"
- Condition: "metabolic disorder"
- Condition: "systemic disorder"
- Condition: "bone deterioration"
- Qualifier: "progressive"
- Condition: "immunologically compromised"
- Drug: "steroids"
- Qualifier: "chronic"
- Temporal: ">30 days"
- Negation: "excluding"
- Drug: "inhalers"
- Non-query-able: "Patients' bone stock is compromised by disease or infection, which cannot provide adequate support and/or fixation to the prosthesis"
- Procedure: "knee fusion"
- Condition: "infection"
- Qualifier: "knee joint"
- Person: "prisoners"